What is the number of long non coding RNAs in the human genome

Different estimates put currently the number of human long non coding RNAs between 10,000 and 20,000